What is achalasia?

Achalasia is a primary esophageal motility disorder characterized by aperistalsis of the esophagus and failed relaxation of the lower esophageal sphincter that presents rarely in childhood. Idiopathic achalasia is a rare esophageal motor disorder.